Written informed consent from participating subject

The above is a clinical trial inclusion criterion. Annotated with entity spans:
[Informed_consent: Written informed consent from participating subject]